52歲女性，於健康檢查時發現血中CEA（carcinoembryonic antigen）升高，但大腸鏡和胸部電腦斷層攝影 檢查皆正常。身體檢查發現甲狀腺有一結節腫，細針抽吸細胞學檢查看到紡綞型的細胞和大而橢圓的細胞，有藍色細胞質（劉氏染色）。則抽血	下列何者可幫助確認診斷？
A. thyroglobulin
B. calcitonin
C. CA-199
D. CA-125

正確答案：B. calcitonin